Informed consent of parent(s) or legal guardian; informed consent or assent of subject as applicable.

The above is a clinical trial inclusion criterion. Annotated with entity spans:
[Observation: Informed consent of parent](s) or legal guardian; [Observation: informed consent] or assent of subject as applicable.